Clinical trial exclusion criterion:
Metal containing corpora aliena in the eye or brain.

Entity relations:
- Has_qualifier("corpora aliena in the brain", "Metal containing")
- Has_qualifier("corpora aliena in the eye", "Metal containing")
- OR("corpora aliena in the eye", "corpora aliena in the brain")